Ludwig's angina 係指何處空間（space）之感染？
A. Pharyngomaxillary space
B. Masseter space
C. Retropharyngeal space
D. Mouth floor space

正確答案：D. Mouth floor space